Clinical trial inclusion criterion:
Healthy obese male and female volunteers aged 18 to 55 years, inclusive. Heterozygous subjects may be 18 to 65 years inclusive.

Entity relations:
- Has_value("aged", "18 to 55 years, inclusive")
- OR("male", "female")